¿Cuál de las siguientes teorizadoras es considerada como la fundadora de la enfermería transcultural?:
1. Madeleine M. Leininger.
2. Rosemarie Rizzo.
3. Dorothy Johnson.
4. Martha E. Rogers.
5. Ramona T. Mercer.

Respuesta correcta: 1. Madeleine M. Leininger.